Adult patients (18years old or older) undergoing living-donor or deceased-donor liver transplantation

The above is a clinical trial inclusion criterion. Annotated with entity spans:
[Person: Adult] patients ([Value: 18years old or older]) undergoing [Procedure: living-donor] or [Procedure: deceased-donor liver transplantation]